Clinical trial inclusion criterion:
Patient able to speak and understand Thai

Annotated entities:
- Observation: "able to speak and understand Thai"
- Post-eligibility: "Patient able to speak and understand Thai"